Clinical trial exclusion criterion:
Uncontrolled concurrent disease

Entity relations:
- Has_qualifier("concurrent disease", "Uncontrolled")